Clinical trial inclusion criterion:
ages of 7 and 75 years

Annotated entities:
- Person: "ages"
- Value: "7 and 75 years"